下列那一種生化實驗技術無法直接應用於蛋白質身分鑑定？
A. ⻄方墨點法（Western blot analysis）
B. 質譜法（mass spectrometry）
C. 分子篩管柱層析法（size-exclusion chromatography）
D. 胺基端序列分析（N-terminal sequencing）

正確答案：C. 分子篩管柱層析法（size-exclusion chromatography）